¿Cómo se llaman las células de las glándulas gástricas que secretan factor intrínseco?:
1. Principales.
2. Parietales.
3. Mucosas.
4. Endocrina.
5. Células del sistema neuroendocrino difuso (SNED).

Respuesta correcta: 2. Parietales.